Cholesterol-lowering drugs

The above is a clinical trial exclusion criterion. Annotated with entity spans:
[Drug: Cholesterol-lowering drugs]